Clinical trial exclusion criterion:
Untreated chronic constipation

Annotated entities:
- Qualifier: "Untreated"
- Condition: "chronic constipation"